Clinical trial exclusion criterion:
surgical interventions within the last 4 days,

Annotated entities:
- Procedure: "surgical interventions"
- Temporal: "last 4 days"